Untreated inflow disease of the ipsilateral pelvic arteries (more than 50%stenosis or or occlusion

The above is a clinical trial exclusion criterion. Annotated with entity spans:
[Qualifier: Untreated] [Condition: inflow disease] of the [Qualifier: ipsilateral pelvic arteries] ([Value: more than 50%][Condition: stenosis] or or [Value: occlusion]